temperature = 37<U+2103>

The above is a clinical trial inclusion criterion. Annotated with entity spans:
[Measurement: temperature] [Value: = 37<U+2103>]